Clinical trial exclusion criterion:
Treatment with strong CYP3A4-inhibitors (e.g. ketoconazole, clarithromycin, nefazodone, ritonavir or atazanavir)

Annotated entities:
- Drug: "strong CYP3A4-inhibitors"
- Drug: "ketoconazole"
- Drug: "clarithromycin"
- Drug: "nefazodone"
- Drug: "ritonavir"
- Drug: "atazanavir"